Clinical trial exclusion criterion:
Contraindications to dapagliflozin according to the local label.

Annotated entities:
- Drug: "dapagliflozin"
- Condition: "Contraindications"